Sufficient number of umbilical cord blood units available for transplantation

The above is a clinical trial inclusion criterion. Annotated with entity spans:
[Value: Sufficient number] of [Measurement: umbilical cord blood units available] [Qualifier: for transplantation]